10. Unexplained, undiagnosed abnormal bleeding per vagina, bleeding per vagina during or following vaginal intercourse, or gynaecologic surgery within 90 days prior to enrollment

The above is a clinical trial exclusion criterion. Annotated with entity spans:
10. [Qualifier: Unexplained], [Qualifier: undiagnosed] [Qualifier: abnormal] [Condition: bleeding per vagina], [Condition: bleeding per vagina] [Temporal: during] or [Temporal: following vaginal intercourse], or [Procedure: gynaecologic surgery] [Temporal: within 90 days prior to enrollment]